Clinical trial exclusion criterion:
Refusal to participate

Annotated entities:
- Non-query-able: "Refusal to participate"
- Post-eligibility: "Refusal to participate"